Has had major surgery to liver or other site within 4 weeks prior to the first dose of study medication

The above is a clinical trial exclusion criterion. Annotated with entity spans:
Has had [Procedure: major surgery] to [Qualifier: liver] or [Qualifier: other site] [Temporal: within 4 weeks prior] to the [Reference_point: first dose of study medication]